促黃體激素潮放（LH surge）的生理是：
A. 由黃體素正向回饋所引起
B. 引起排卵的必要條件
C. 發生在卵子離開濾泡後
D. 可促進顆粒層細胞合成雌激素

正確答案：B. 引起排卵的必要條件